Clinical trial exclusion criterion:
15. In the investigator's opinion, subject has a co-morbid condition(s) that could limit the life expectancy to less than one year, or limit the subject's ability to participate in the study or comply with follow-up requirements or impact the scientific integrity of the study.

Entity relations:
- multi("life expectancy", "life expectancy")
- Has_value("life expectancy", "less than one year")